下列有關脊椎損傷患者自主神經異常反射（autonomic dysreflexia）的敘述何者正確？
A. 是一種副交感神經系統（parasympathetic）的反射行為
B. 此反射主要是由薦椎傳入神經的刺激所引發的作用
C. 臨床上會有低血壓及心跳加速的症狀
D. 這種情形常見於第八胸椎脊髓（T8）受傷的病人

正確答案：B. 此反射主要是由薦椎傳入神經的刺激所引發的作用